Clinical trial inclusion criterion:
Absence of dyspnea

Entity relations:
- Has_negation("dyspnea", "Absence of")